Clinical trial exclusion criterion:
ASA classification >= IV.

Entity relations:
- Has_value("ASA classification", ">= IV")